Clinical trial inclusion criterion:
concomitant oral or i.v. therapy with strong CYP3A Inhibitors (e.g. ketoconazole, itraconazole, voriconazole, telithromycin, clarithromycin, nefazodone, ritonavir, saquinavir, nelfinavir, indinavir, atazanavir, grapefruit juice > 1 L/d), CYP3A substrates with narrow therapeutic indices (e.g. cyclosporine, quinidine), or strong CYP3A inducers (e.g. rifampin/rifampicin, phenytoin, carbamazepine, dexamethason, phenobarbital ) that cannot be safely discontinued

Entity relations:
- Has_multiplier("grapefruit juice", "> 1 L/d")
- Subsumes("strong CYP3A Inhibitors", "ketoconazole")
- AND("oral therapy", "strong CYP3A Inhibitors")
- Subsumes("strong CYP3A inducers", "rifampin")
- Subsumes("CYP3A substrates with narrow therapeutic indices", "cyclosporine")
- OR("ketoconazole", "itraconazole", "voriconazole", "telithromycin", "clarithromycin", "nefazodone", "ritonavir", "saquinavir", "nelfinavir", "indinavir", "atazanavir", "grapefruit juice")
- OR("oral therapy", "i.v. therapy")
- OR("rifampin", "phenytoin", "carbamazepine", "dexamethason", "phenobarbital", "rifampicin")
- OR("cyclosporine", "quinidine")